Clinical trial exclusion criterion:
4. Other medical complications that might preclude one from participating in the study, i.e., recent heart attack or stroke or chronic kidney disease.

Entity relations:
- Has_temporal("heart attack", "recent")
- Has_qualifier("medical complications", "Other")
- Has_negation("participating in the study", "preclude")
- AND("medical complications", "participating in the study")
- AND("medical complications", "heart attack")
- OR("heart attack", "stroke", "chronic kidney disease")